Clinical trial exclusion criterion:
Premorbid, ongoing major depression or psychosis, altered cognitive status

Annotated entities:
- Qualifier: "Premorbid"
- Temporal: "ongoing"
- Condition: "major depression"
- Condition: "psychosis"
- Condition: "altered cognitive status"